El material genético del virus de la gripe se replica en el:
1. Lisosoma.
2. Citoplasma celular.
3. Núcleo de la célula.
4. Endosoma.
5. Aparato de Golgi.

Respuesta correcta: 3. Núcleo de la célula.